El glutatión cumple todo lo que siguiente excepto:
1. Es un dipéptido.
2. Elimina peróxidos y radicales libres.
3. Participa en la destoxificación de compuestos.
4. Actúa como cofactor de algunas enzimas.
5. Protege frente al estrés oxidativo.

Respuesta correcta: 1. Es un dipéptido.